Clinical trial inclusion criterion:
Patients between 3 to 16 years of age undergoing adenotonsillectomy, with or without myringotomy or myringoplasty

Annotated entities:
- Value: "between 3 to 16 years"
- Person: "age"
- Procedure: "adenotonsillectomy"
- Temporal: "undergoing"
- Procedure: "myringotomy"
- Procedure: "myringoplasty"